醫院遇有危急病人，應先予適當之急救，若病人為路倒病人且負擔不起醫療費用時，依據醫療法的規定，其費用應如何處理？
A. 由醫院列為呆帳自行吸收
B. 由醫院提撥之社福基金補助
C. 由全民健保補助
D. 由直轄市或縣市政府社政單位補助

正確答案：D. 由直轄市或縣市政府社政單位補助